下列何種血紅素比例的增加，是乙型海洋性貧血基因帶原（ °-heterozygous）的重要特徵？
A. 血紅素 A（Hb A）
B. 血紅素 A2（Hb A2）
C. 血紅素 H（Hb H）
D. 血紅素 Barts（Hb Barts）

正確答案：B. 血紅素 A2（Hb A2）